Clinical trial inclusion criterion:
3. Patients with DN must have had Type I or II diabetes and painful distal symmetric sensorimotor polyneuropathy with or without dynamic allodynia of the lower extremities

Entity relations:
- Has_qualifier("sensorimotor polyneuropathy", "painful")
- Has_qualifier("sensorimotor polyneuropathy", "distal")
- Has_qualifier("sensorimotor polyneuropathy", "symmetric")
- AND("DN", "Type I diabetes")
- AND("DN", "Type II diabetes")
- AND("DN", "sensorimotor polyneuropathy")